Tricuspid valve stenosis, Supra-pulmonary valve stenosis

The above is a clinical trial exclusion criterion. Annotated with entity spans:
[Condition: Tricuspid valve stenosis], [Condition: Supra-pulmonary valve stenosis]